下列有關不明熱（fever of unknown origin）的分類，何者錯誤？
A. 院內型的不明熱（nosocomial FUO）
B. 社區型的不明熱（community FUO）
C. 愛滋病毒相關的不明熱（HIV associated FUO）
D. 嗜中性白血球低下的不明熱（neutropenic FUO）

正確答案：B. 社區型的不明熱（community FUO）